Evidence of current uncontrolled cardiovascular conditions, including uncontrolled hypertension, uncontrolled cardiac arrhythmias, symptomatic congestive heart failure, unstable angina, or myocardial infarction within the past 6 months.

The above is a clinical trial exclusion criterion. Annotated with entity spans:
Evidence of [Temporal: current] [Qualifier: uncontrolled] [Condition: cardiovascular conditions], including [Qualifier: uncontrolled] [Condition: hypertension], [Qualifier: uncontrolled] [Condition: cardiac arrhythmias], [Qualifier: symptomatic] [Condition: congestive heart failure], [Condition: unstable angina], or [Condition: myocardial infarction] [Temporal: within the past 6 months].